一個18歲女孩穿耳環在耳廓上部，引起耳廓化膿性軟骨膜炎（perichondritis of auricle），下列何者為最可能致病的菌種？
A. Streptococcus pneumoniae
B. Haemophilus influenzae
C. Pseudomonas aeruginosa
D. Klebsiella pneumoniae

正確答案：C. Pseudomonas aeruginosa